contraindications to sildenafil use or CMR imaging;

The above is a clinical trial exclusion criterion. Annotated with entity spans:
[Condition: contraindications] to [Drug: sildenafil] use or [Procedure: CMR imaging];